Clinical trial inclusion criterion:
Volunteer chronically infected with HCV (as demonstrated by serology and/or viral load laboratory studies)

Annotated entities:
- Condition: "HCV infected"
- Qualifier: "chronically"